one additional cytotoxic regimen and/or PARP inhibitor for management of recurrent or persistent disease.

The above is a clinical trial inclusion criterion. Annotated with entity spans:
[Multiplier: one additional] [Drug: cytotoxic regimen] and/or [Drug: PARP inhibitor] for management of [Temporal: recurrent] or [Temporal: persistent] [Condition: disease].